調控紅血球與O2親合力的重要因子為 2,3-bisphosphoglycerate，它由下列那種代謝作用所提供？
A. 酮體生成作用（ketogenesis）
B. 糖解作用（glycolysis）
C. 葡萄糖新生作用（gluconeogenesis）
D. 五碳糖磷酸途徑（pentose phosphate pathway）

正確答案：B. 糖解作用（glycolysis）